Clinical trial exclusion criterion:
Positive serology for HBsAg, HCV or HIV antibodies

Annotated entities:
- Measurement: "HBsAg antibodies"
- Measurement: "HCV antibodies"
- Measurement: "HIV antibodies"
- Value: "Positive"